Clinical trial exclusion criterion:
chronic pancreatitis or pancreatic cancer

Annotated entities:
- Condition: "chronic pancreatitis"
- Condition: "pancreatic cancer"